Primary Sjögren's syndrome with the diagnosis made by the American-European criteria.

The above is a clinical trial inclusion criterion. Annotated with entity spans:
[Condition: Primary Sjögren's syndrome] with the diagnosis made by the [Qualifier: American-European criteria].